Clinical trial exclusion criterion:
Fibrinolytics within 24 hours

Entity relations:
- Has_temporal("Fibrinolytics", "within 24 hours")